Metastatic endometrial cancer (EM)

The above is a clinical trial inclusion criterion. Annotated with entity spans:
[Condition: Metastatic endometrial cancer] (EM)